下列有關乳房Paget disease之敘述，何者錯誤？
A. 一種由乳管內乳癌（intraductal carcinoma）生成之乳癌
B. 原始病灶在乳暈
C. 乳頭及乳暈皮膚呈濕疹樣（eczematous eruption）或牛皮疹（psoriatic rash）
D. 需切片檢查以鑑別診斷皮膚病變

正確答案：B. 原始病灶在乳暈